Receiving a prescription of Adalimumab 40 mg subcutaneous every two weeks.

The above is a clinical trial inclusion criterion. Annotated with entity spans:
Receiving a prescription of [Drug: Adalimumab] [Multiplier: 40 mg] [Qualifier: subcutaneous] every two weeks.